Paciente de 45 años que acude a urgencias por malestar general, cefalea y cansancio progresivo en las últimas semanas. A la exploración física se detecta un ligero tinte ictérico de piel y mucosas y se palpa esplenomegalia de 2 cm bajo el reborde     costal.    La     analítica    presenta hemoglobina 8,6 g/dL, VCM 100 fL. La cifra de reticulocitos está elevada y en el frotis de sangre se    observa     anisopoiquilocitosis.    En    la bioquímica destaca LDH 1300 UI/L, bilirrubina 2,2 mg/dL y haptoglobina indetectable. ¿Qué prueba es la más apropiada para orientar el diagnóstico de la paciente?
1. Test de sangre oculta en heces.
2. Test de Coombs.
3. Determinación de hierro, cobalamina y ácido fólico.
4. Ecografía abdominal.
5. Aspirado de médula ósea.

Respuesta correcta: 2. Test de Coombs.